3. Weight: At least 60 kg (132 lbs) for man and 48 kg (106 lbs) for women and within 15% of Ideal Body Weight (IBW), as referenced by the Table of ""Desirable Weights of Adults"" Metropolitan Life Insurance Company, 1999 (See Part II ADMINISTRATIVE ASPECTS OF BIOEQUIVALENCE PROTOCOLS).

The above is a clinical trial inclusion criterion. Annotated with entity spans:
3. [Measurement: Weight]: [Value: At least 60 kg] (132 lbs) for [Person: man] and 48 kg (106 lbs) for [Person: women] and [Value: within 15% of Ideal Body Weight (IBW)], as referenced by the Table of ""Desirable Weights of Adults"" Metropolitan Life Insurance Company, 1999 (See Part II ADMINISTRATIVE ASPECTS OF BIOEQUIVALENCE PROTOCOLS).